Male or female patients = 18 and = 85 years of age

The above is a clinical trial inclusion criterion. Annotated with entity spans:
[Person: Male] or [Person: female] patients [Value: = 18 and = 85 years] of [Person: age]